Clinical trial exclusion criterion:
Age <18 years old

Entity relations:
- Has_value("Age", "<18 years old")